有關鑑別妄想型思覺失調症（paranoid schizophrenia）與安非他命精神病臨床特徵，下列何者正確？
A. 安非他命精神病常具有連結鬆散（loosening of association）
B. 安非他命精神病少有視幻覺
C. 妄想型思覺失調症較多情感平淡（affective flattening）
D. 安非他命精神病較會有性活動下降（hypo-sexuality）

正確答案：C. 妄想型思覺失調症較多情感平淡（affective flattening）